El prurito es una manifestación típica de todas las siguientes enfermedades, salvo:
1. Linfoma de Hodgkin.
2. Policitemia vera.
3. Micosis fungoide.
4. Mastocitosis sistémica.
5. Leucemia aguda mieloblástica.

Respuesta correcta: 5. Leucemia aguda mieloblástica.